Clinical trial exclusion criteria:
Known proved BKV nephropathy
Hypersensitivity to everolimus, sirolimus or excipient
Concomitant treatment by leflunomide, cidofovir, sirolimus, Millepertuis (Hypericum Perforatum)
Pregnant or lactating women
Women of child bearing potential unless they are using a birth control method

Annotated entities:
- Qualifier: "proved"
- Condition: "BKV nephropathy"
- Condition: "Hypersensitivity"
- Drug: "everolimus"
- Drug: "sirolimus"
- Drug: "excipient"
- Temporal: "Concomitant"
- Drug: "leflunomide"
- Drug: "cidofovir"
- Drug: "sirolimus"
- Drug: "Millepertuis"
- Drug: "Hypericum Perforatum"
- Condition: "Pregnant"
- Condition: "lactating"
- Person: "women"
- Person: "Women"
- Condition: "child bearing potential"
- Negation: "unless"
- Procedure: "birth control method"